pathological obesity

The above is a clinical trial exclusion criterion. Annotated with entity spans:
[Condition: pathological obesity]